多囊性卵巢症候群不會增加下列那一疾病的危險性？
A. 子宮內膜癌
B. 子宮頸癌
C. 不孕症
D. 糖尿病

正確答案：B. 子宮頸癌